下列有關周邊神經組織（peripheral nervous tissue）的敘述，何者錯誤？
A. 神經內膜（endoneurium）的膠原纖維大部分由纖維母細胞（fibroblast）所合成
B. 神經束膜（perineurium）是由扁平的神經束膜細胞（perineurial cell）所構成
C. 神經束膜細胞（perineurial cell）間之緊密結合（tight junction）形成血-神經屏障（blood-nerve barrier）
D. 神經外膜（epineurium）由典型的緻密結締組織（dense connective tissue）所構成

正確答案：A. 神經內膜（endoneurium）的膠原纖維大部分由纖維母細胞（fibroblast）所合成